下列有關微量元素（trace element） 的敘述何者錯誤？
A. beriberi disease是因為缺乏硒（selemuim）
B. 缺乏鋅（zinc）會造成禿頭（alopecia）
C. 接受過胃切除的病患容易缺乏鐵（iron）
D. 缺乏vitamin D會造成骨質疏鬆（osteoporosis）

正確答案：A. beriberi disease是因為缺乏硒（selemuim）